Cancer requiring treatment in past year (except skin)

The above is a clinical trial exclusion criterion. Annotated with entity spans:
[Condition: Cancer] requiring [Procedure: treatment] in [Temporal: past year] (except skin)